Clinical trial inclusion criterion:
Willing to receive three doses of an FDA-approved Hepatitis B vaccine

Annotated entities:
- Post-eligibility: "Willing to receive three doses of an FDA-approved Hepatitis B vaccine"